Clinical trial exclusion criterion:
History of head injury or stroke,

Annotated entities:
- Condition: "head injury"
- Condition: "stroke"
- Temporal: "History of"